Clinical trial inclusion criterion:
Planned thoracoscopy with low probability(by surgeon estimate) of conversion to open procedure

Annotated entities:
- Procedure: "thoracoscopy"
- Subjective_judgement: "low probability(by surgeon estimate) of conversion to open procedure"
- Undefined_semantics: "low probability(by surgeon estimate) of conversion to open procedure"
- Non-query-able: "Planned thoracoscopy with low probability(by surgeon estimate) of conversion to open procedure"
- Qualifier: "low probability(by surgeon estimate) of conversion to open procedure"